有關急性腎衰竭的敘述，下列何者錯誤？
A. 腎前性的腎衰竭是最常見的原因，通常尿液的鈉離子濃度＜10 mmol/L
B. 缺血性腎衰竭引起的腎小管壞死即使在給予矯正腎血流後，腎功能絕對不會恢復
C. 腎毒性藥物，譬如抗生素或是抗癌藥，引起的急性腎衰竭通常是對於近端腎小管的傷害
D. 病人尿量若一天少於 100 mL，應考慮可能是阻塞性的腎衰竭

正確答案：B. 缺血性腎衰竭引起的腎小管壞死即使在給予矯正腎血流後，腎功能絕對不會恢復